To which family does the Zika virus belong?

The Zika virus belongs to the family Flaviviridae.